How many genera comprise the Flaviviridae family?

The family Flaviviridae is comprised of three genera: Flavivirus, Pestivirus and Hepacivirus.